Clinical trial exclusion criterion:
Advanced male factor infertility.

Entity relations:
- Has_qualifier("male factor infertility", "Advanced")